Clinical trial exclusion criterion:
frequent urinary tract infections

Annotated entities:
- Multiplier: "frequent"
- Condition: "urinary tract infections"